72歲男性，出現波動性的認知障礙及注意力不集中（fluctuating cognitive and attention disturbances），並且有視幻覺（visual hallucination）。這半年來，除了上述病症加劇外，病人出現記憶力衰退，肢體僵硬，步態緩慢，並容易跌倒。其最可能的診斷為何？
A. 阿茲海默症（Alzheimer disease）
B. 路易氏體失智症（dementia with Lewy bodies）
C. 巴金森氏失智症（Parkinson disease dementia）
D. 進行性核上麻痺（progressive supranuclear palsy）

正確答案：B. 路易氏體失智症（dementia with Lewy bodies）